22. Absolute neutrophil count <1500 mm3.

The above is a clinical trial exclusion criterion. Annotated with entity spans:
[Parsing_Error: 22.] [Measurement: Absolute neutrophil count] [Value: <1500 mm3].